下列有關心雜音（heart murmur）之敘述，何者錯誤？
A. 正常健康的人不應該有心雜音
B. 收縮期雜音在第一心音之時或稍後，而結束於接下來的第二心音或稍前
C. 當頸動脈搏動（upstroke）時，其心雜音為收縮期雜音；頸動脈下沉時，其心雜音為舒張期雜音
D. 舒張期雜音發生於第二心音之時或稍後，而結束於接下來的第一心音或稍前

正確答案：A. 正常健康的人不應該有心雜音